Absence of hemodynamic collapse, or decompensation, at presentation; Hemodynamic collapse or decompensation

The above is a clinical trial inclusion criterion. Annotated with entity spans:
[Negation: Absence] of [Condition: hemodynamic collapse], or decompensation, at presentation; Hemodynamic collapse or decompensation